Should edasalonexent be used for Duchenne muscular dystrophy patients?

No. In phase 3 clinical trial edasalonexent did not achieve statistical significance for improvement in primary and secondary functional endpoints for assessment of Duchenne muscular dystrophy. However, subgroup analysis suggested that edasalonexent may slow disease progression if initiated before 6 years of age.